Clinical trial exclusion criterion:
Patients with liver cirrhosis, Hepatocellular Carcinoma or other malignancies.

Annotated entities:
- Condition: "liver cirrhosis"
- Condition: "Hepatocellular Carcinoma"
- Condition: "malignancies"